Clinical trial inclusion criterion:
Postoperative TNM(primary tumor,regional nodes,metastasis) staging III~IV, positive surgical margin.

Annotated entities:
- Measurement: "TNM staging"
- Qualifier: "Postoperative"
- Value: "III~IV,"
- Value: "positive"
- Measurement: "surgical margin"